1. Justification: it is unknown whether TMS poses a risk to fetuses.

The above is a clinical trial exclusion criterion. Annotated with entity spans:
[Parsing_Error: 1.] [Parsing_Error: Justification: it is unknown whether TMS poses a risk to fetuses.]